Clinical trial exclusion criterion:
Patients with 2 or more doses of methylprednisolone/prednisone per day

Entity relations:
- Has_multiplier("methylprednisolone", "2 or more doses per day")
- OR("methylprednisolone", "prednisone")